Pregnancy

The above is a clinical trial inclusion criterion. Annotated with entity spans:
[Condition: Pregnancy]